Clinical trial inclusion criterion:
HbA1c < 10%;

Entity relations:
- Has_value("HbA1c", "< 10%")